Clinical trial inclusion criteria:
Blood culture-proven typhoid fever (S. typhi or S. paratyphi)
Signed informed consent to participate in the study.

Annotated entities:
- Measurement: "Blood culture"
- Value: "proven"
- Condition: "typhoid fever"
- Condition: "S. typhi"
- Condition: "S. paratyphi"
- Post-eligibility: "Signed informed consent to participate in the study."
- Non-query-able: "Signed informed consent to participate in the study."